Clinically significant out of range values of serum levels of either alanine aminotransferase (ALT), aspartate aminotransferase (AST) or alkaline phosphatase (ALP) in the Investigator's opinion.

The above is a clinical trial exclusion criterion. Annotated with entity spans:
[Qualifier: Clinically significant] [Value: out of range values] of serum levels of either [Measurement: alanine aminotransferase (ALT)], [Measurement: aspartate aminotransferase (AST)] or [Measurement: alkaline phosphatase (ALP)] in the Investigator's opinion.